有關糖皮質激素（glucocorticoids）作用的敘述，下列何者錯誤？
A. 糖皮質激素具有增加血中葡萄糖與脂肪酸之作用
B. 在空腹狀態糖皮質激素具有促進糖質新生（gluconeogenesis）的作用
C. 投予短效型糖皮質激素會減少循環系統中的嗜中性白血球（neutrophils）的數目，反之，淋巴細胞（lymphocytes）的數目會增加
D. 糖皮質激素直接	抹在皮膚表面會造成局部血管收縮的作用

正確答案：C. 投予短效型糖皮質激素會減少循環系統中的嗜中性白血球（neutrophils）的數目，反之，淋巴細胞（lymphocytes）的數目會增加